LVEF <40% or clinically overt congestive heart failure

The above is a clinical trial exclusion criterion. Annotated with entity spans:
[Measurement: LVEF] [Value: <40%] or [Qualifier: clinically overt] [Condition: congestive heart failure]